Clinical trial exclusion criterion:
Pacing threshold(s) (at 0.4 or 0.5 ms) and/or sensing amplitude(s) and/or impedance(s) are not measurable

Annotated entities:
- Procedure: "Pacing threshold"
- Qualifier: "at 0.4 or 0.5 ms"
- Condition: "not measurable"
- Procedure: "sensing amplitude"
- Procedure: "impedance"